Are using hormonal contraceptives, but are not on a stable dose of the same hormonal contraceptive product for at least 4 weeks before dosing and who do not agree to use the same contraceptive during the study and for 28 days after study drug discontinuation (Note: All female participants will be considered to be of childbearing potential unless they have been sterilized surgically [ie, bilateral tubal ligation, total hysterectomy, or bilateral oophorectomy, all with surgery at least 1 month before dosing]).

The above is a clinical trial exclusion criterion. Annotated with entity spans:
Are using [Drug: hormonal contraceptives], but are [Negation: not] on a [Qualifier: stable dose] of [Qualifier: the same] [Drug: hormonal contraceptive] product [Temporal: for at least 4 weeks before dosing] and who [Observation: do not agree] to use [Qualifier: the same] [Drug: contraceptive] [Temporal: during the study] and [Temporal: for 28 days after study drug discontinuation] [Non-representable: (Note: All female participants will be considered to be of childbearing potential unless they have been sterilized surgically [ie, bilateral tubal ligation, total hysterectomy, or bilateral oophorectomy, all with surgery at least 1 month before dosing])].